Clinical trial exclusion criterion:
an inability to understand the questionnaires

Annotated entities:
- Observation: "inability to understand the questionnaires"